Clinical trial exclusion criterion:
Subject with uncontrolled atrial fibrillation/flutter at screening (defined as ventricular response rate = 100 bpm)

Entity relations:
- Has_qualifier("atrial fibrillation", "uncontrolled")
- Has_temporal("atrial fibrillation", "at screening")
- Has_value("ventricular response rate", "= 100 bpm")
- Subsumes("atrial fibrillation", "ventricular response rate")
- OR("atrial fibrillation", "atrial flutter")